Clinical trial inclusion criterion:
ASA I and II women

Entity relations:
- Has_value("ASA", "I and II")